Clinical trial exclusion criterion:
Evidence of systemic disease or neoplasia expected to compromise survival during 5-yr period

Entity relations:
- Has_qualifier("systemic disease", "expected to compromise survival")
- Has_temporal("expected to compromise survival", "during 5-yr period")
- OR("systemic disease", "neoplasia")